Clinical trial exclusion criterion:
Patients on perioperative intravenous (IV) steroids.

Annotated entities:
- Temporal: "perioperative"
- Drug: "intravenous (IV) steroids"